List drug that were evaluated in the CHAMP trial for migraine.

Childhood and Adolescent Migraine Prevention (CHAMP) trial evaluated effectiveness of amitriptyline and topiramate in the prevention of migraine in children and adolescents.